Clinical trial exclusion criterion:
Subject who showed medically significant adverse events or intolerance with aripiprazole during screening period or as prior experiences.

Entity relations:
- Has_qualifier("adverse events", "medically significant")
- AND("adverse events", "aripiprazole")
- Has_temporal("adverse events", "during screening period")
- OR("during screening period", "as prior experiences")
- OR("adverse events", "intolerance")